對嬰幼兒進行氣管插管時，容易造成進入左側或右側的支氣管內，其最主要原因為何？
A. 氣管相對較短
B. 上唇至喉頭部的距離相對較短
C. 氣管內管不具氣囊，固定效果不佳，故易滑入
D. 主支氣管與氣管間的角度不夠大所導致

正確答案：A. 氣管相對較短